對於食道破裂（esophageal perforation）的敘述，下列何者錯誤？
A. 食道破裂超過一天才被診斷，死亡率常超過50%
B. 患者頸部及胸部常有皮下氣腫（subcutaneous emphysema）的情形
C. 手術治療食道破裂是非必要的
D. 患者常合併膿胸和急性縱膈腔炎

正確答案：C. 手術治療食道破裂是非必要的